Clinical trial exclusion criterion:
Unexplained bleeding from the genital tract

Entity relations:
- Has_qualifier("Unexplained bleeding", "genital tract")